1歲大女嬰因為每天解綠黏血絲便2至3次，間斷式體溫上升至38℃已經2天，體重從10公斤降至9.8公斤，給 與腹瀉藥物和飲食控制。3天後血絲便減至每天1次，大便培養為非傷寒沙門氏桿菌（Nontyphoidal 
 Salmonella）感染，此時體溫37.5℃，體重為9.7公斤，精神及活動力正常，下列處置何者最為恰當？
A. 應給與電解質口服液或稀飯等清淡飲食，開給口服抗生素治療至少7天
B. 應住院打點滴並禁食，給與靜脈抗生素治療至少7天
C. 應給與電解質口服液或稀飯等清淡飲食，無需給與口服抗生素
D. 應該住院打點滴並禁食，無需給與抗生素

正確答案：C. 應給與電解質口服液或稀飯等清淡飲食，無需給與口服抗生素